有關復發性多軟骨炎（relapsing polychondritis）的敘述，下列何者正確？
A. 大部分病人會有類風濕因子（rheumatoid factor）陽性
B. 大多數的病人會合併關節炎
C. 大約有90%的病人會合併其他自體免疫疾病
D. 治療以抗腫瘤壞死因子（anti-TNF）生物製劑為主

正確答案：B. 大多數的病人會合併關節炎